¿Cómo se denomina al conjunto de actividades consistentes en crear y mantener un ambiente adecuado en el que los individuos, trabajando en grupo, puedan llevar a cabo funciones y objetivos preestablecidos?
1. Operativizar.
2. Administrar.
3. Objetivar.
4. Planificar.
5. Valorar.

Respuesta correcta: 2. Administrar.